Clinical trial exclusion criterion:
Inability to perform exercise tests

Entity relations:
- AND("Inability to perform", "exercise tests")